Age from 18 to 74 years

The above is a clinical trial inclusion criterion. Annotated with entity spans:
[Person: Age] [Value: from 18 to 74 years]